心房中隔缺損（atrial septal defect）最常發生於下列何處？
A. 卵圓孔（oval foramen）
B. 冠狀竇（coronary sinus）
C. 右心耳（right auricle）
D. 終嵴（crista terminalis）

正確答案：A. 卵圓孔（oval foramen）